下列關於維生素E（vitamin E）的敘述，何者正確？
A. 維生素E為單碳代謝（one-carbon metabolism）反應中重要的輔酶
B. 維生素E為醌（quinone）的衍生物
C. 食物中維生素E的成分含有tocopherols與tocotrienols
D. 人體在接受陽光照射後，可自行合成維生素E

正確答案：C. 食物中維生素E的成分含有tocopherols與tocotrienols